For women, pregnancy, lactation, or unwillingness to comply with birth control requirements.

The above is a clinical trial exclusion criterion. Annotated with entity spans:
[Pregnancy_considerations: For women, pregnancy, lactation, or unwillingness to comply with birth control requirements].